Clinical trial exclusion criteria:
Contraindication for the use of corticosteroids or local anesthetics
Presence of inflammatory arthropathy or neuropathy
Skin lesions in the area
diabetes mellitus
Infiltration or previous surgery in the area
Refusal to participate in the study

Annotated entities:
- Drug: "corticosteroids"
- Drug: "local anesthetics"
- Condition: "Contraindication"
- Condition: "inflammatory arthropathy"
- Condition: "neuropathy inflammatory"
- Condition: "Skin lesions"
- Condition: "diabetes mellitus"
- Procedure: "previous surgery"
- Condition: "Infiltration"
- Post-eligibility: "Refusal to participate in the stud"